一位 65 歲男性，5 年前接受過膽囊切除術及總膽管十二指腸吻合術（Cholecystectomy and choledochoduodenostomy），最近三天出現上腹痛、發燒、畏寒（Chills）及暗色尿液（Dark urine），由上述症狀醫師懷疑有上行性膽道炎（Ascending cholangitis），則下列何項是最可能的檢查結果？
A. Amylase level 上升，其他正常
B. Alkaline phosphatase 上升，而 Bilirubin level 正常或上升
C. Serum BUN 異常上升
D. 尿中出現 Urobilin

正確答案：B. Alkaline phosphatase 上升，而 Bilirubin level 正常或上升